Cancer within the last 5 years except prostate cancer and surgically removed basal or squamous cell carcinoma of the skin

The above is a clinical trial exclusion criterion. Annotated with entity spans:
[Condition: Cancer] within the [Temporal: last 5 years] [Negation: except] [Condition: prostate cancer] and [Procedure: surgically] removed [Condition: basal] or [Condition: squamous cell carcinoma of the skin]